Clinical trial inclusion criterion:
Single or twin pregnancies

Entity relations:
- AND("Single", "pregnancies")
- OR("Single", "twin")